Clinical trial exclusion criterion:
Known or suspected allergy to trial product(s) or related products

Annotated entities:
- Condition: "allergy to trial product(s)"
- Condition: "allergy related products"
- Drug: "trial product(s)"
- Drug: "related products"